對於腹腔腔室症候群（abdominal compartment syndrome）的敘述，下列何者錯誤？
A. 腹腔腔室症候群通常發生在多重創傷和加護病房的病患
B. 放置鼻胃管是間接測量腹內壓的主要方法
C. 正常的腹內壓大概是5 mmHg，壓力大於12 mmHg會造成呼吸困難，壓力到達25 mmHg會造成下腔靜脈
D. 決定是否開刀的因素除了腹內高壓以外，和腹內高壓相關的器官衰竭也是重要考慮因素

正確答案：B. 放置鼻胃管是間接測量腹內壓的主要方法